Clinical trial inclusion criterion:
10. Serum creatinine ≤1.5 × ULN and glomerular filtration rate (GFR) > 30 mL/min

Annotated entities:
- Measurement: "Serum creatinine"
- Value: "≤1.5 × ULN"
- Measurement: "glomerular filtration rate (GFR)"
- Value: "> 30 mL/min"